chronic obstructive pulmonary disease (COPD), GOLD grade 2-3

The above is a clinical trial inclusion criterion. Annotated with entity spans:
[Condition: chronic obstructive pulmonary disease] ([Condition: COPD]), [Measurement: GOLD grade] [Value: 2-3]